Patients with kyphoplasty cement or hardware that would preclude effective catheter placement.

The above is a clinical trial exclusion criterion. Annotated with entity spans:
Patients with [Device: kyphoplasty cement] or hardware that would [Qualifier: preclude effective catheter placement].